Clinical trial inclusion criterion:
Patient with primary pulmonary hypertension (i.e. Idiopathic Pulmonary Arterial Hypertension or Familial Pulmonary Arterial Hypertension) and classified as NYHA functional class III (NYHA = New York Heart Association)

Annotated entities:
- Condition: "primary pulmonary hypertension"
- Condition: "Idiopathic Pulmonary Arterial Hypertension"
- Condition: "Familial Pulmonary Arterial Hypertension"
- Measurement: "NYHA functional class"
- Value: "III"